Clinical trial exclusion criterion:
Patients with a current seizure disorder, organic brain disorder or a history of seizure disorders (except for febrile seizures in childhood).

Annotated entities:
- Condition: "seizure disorder"
- Condition: "organic brain disorder"
- Condition: "history of seizure disorders"
- Negation: "except"
- Condition: "febrile seizures"
- Qualifier: "childhood"